Clinical trial inclusion criterion:
evaluated for an STI within 6 months prior to screening

Annotated entities:
- Procedure: "evaluated for an STI"
- Temporal: "within 6 months prior to screening"
- Reference_point: "screening"